Clinical trial exclusion criterion:
Internal, neurologic, rheumatologic or psychiatric disease including current heavy smoking (>20 cigarettes per day)

Annotated entities:
- Condition: "psychiatric disease"
- Condition: "rheumatologic disease"
- Condition: "neurologic disease"
- Condition: "Internal disease"
- Observation: "heavy smoking"
- Multiplier: ">20 cigarettes per day"